En la primera etapa del tratamiento cognitivo comportamental de Fairburn para la bulimia nerviosa uno de los objetivos es:
1. Modificar los patrones de interacción social desadaptativos.
2. Instaurar patrones de comunicación eficaces.
3. Trabajar en la supresión del seguimiento de dietas.
4. Modificar los patrones de funcionamiento familiar deadaptativos.
5. Presentar el modelo que explica el mantenimiento del problema.

Respuesta correcta: 5. Presentar el modelo que explica el mantenimiento del problema.